某些人類白血球抗原（Human Leukocyte Antigens, HLA）基因在某自體免疫疾病患者中的存在有較為增高現象，是為有較高的「相較性的危險值」（relative risk）引起自體免疫致病性。有關這些相關性下列那一項敘述正確？
A. B27 對於第一型糖尿病（type 1 diabetes mellitus）
B. B27 對於葛瑞夫氏症（Graves' disease）
C. B27 對於尋常天疱瘡（pemphigus vulgaris）
D. B27 對於僵直性脊椎炎（Ankylosing spondylitis）

正確答案：D. B27 對於僵直性脊椎炎（Ankylosing spondylitis）